Clinical trial exclusion criterion:
History of disabling neurological or psychiatric condition such as epilepsy, multiple sclerosis, cortical stroke, hypoxic-ischemic encephalopathy, encephalitis, or schizophrenia

Annotated entities:
- Temporal: "History"
- Condition: "disabling neurological condition"
- Condition: "disabling psychiatric condition"
- Condition: "epilepsy"
- Condition: "multiple sclerosis"
- Condition: "cortical stroke"
- Condition: "hypoxic-ischemic encephalopathy"
- Condition: "encephalitis"
- Condition: "schizophrenia"